Clinical trial exclusion criteria:
Age less than 18 years
Significant arterial disease (Ankle Brachial Pressure Index <0•9 or evidence on Arterial Duplex)
Acute Deep Vein Thrombosis
Patient unable or unwilling to have high compression (30mmHg minimum)
Patients with dexterity insufficiency of hands
Patients with peripheral neuropathy
Leg ulcers of another underlying cause
Leg ulcers of greater than 1 year duration
Patients unable or unwilling to provide written, informed consent

Annotated entities:
- Person: "Age"
- Value: "less than 18 year"
- Condition: "arterial disease"
- Qualifier: "Significant"
- Measurement: "Ankle Brachial Pressure Index"
- Value: "<0•9"
- Procedure: "Arterial Duplex"
- Condition: "Acute Deep Vein Thrombosis"
- Post-eligibility: "Patient unable or unwilling to have high compression (30mmHg minimum)"
- Condition: "dexterity insufficiency of hands"
- Condition: "peripheral neuropathy"
- Condition: "Leg ulcers"
- Condition: "underlying cause"
- Qualifier: "another"
- Condition: "Leg ulcers"
- Temporal: "greater than 1 year duration"
- Post-eligibility: "Patients unable or unwilling to provide written, informed consent"